Clinical trial exclusion criterion:
11. Infectious disease screen is positive for HIV or Hepatitis A, B or C.

Annotated entities:
- Parsing_Error: "11."
- Condition: "HIV"
- Condition: "Hepatitis A"
- Condition: "Hepatitis B"
- Condition: "Hepatitis C"